Clinical trial exclusion criteria:
beta blocker
supraventricular rhythm disorder
previous history of respiratory disease other than COPD
diabetes
autonomic dysfunction
dysautonomia
renal failure
long-term oxygen therapy
history of psychiatric illness

Annotated entities:
- Drug: "beta blocker"
- Condition: "supraventricular rhythm disorder"
- Temporal: "previous history"
- Condition: "respiratory disease"
- Negation: "other than"
- Condition: "COPD"
- Condition: "diabetes"
- Condition: "autonomic dysfunction"
- Condition: "dysautonomia"
- Condition: "renal failure"
- Procedure: "long-term oxygen therapy"
- Temporal: "history"
- Condition: "psychiatric illness"